Clinical trial inclusion criteria:
Patients with biopsy-proven metastatic carcinoid tumors or other neuroendocrine tumors (Islet cell, Gastrinomas and VIPomas) with at least one measurable lesion (other than bone) that has either not been previously irradiated or if previously irradiated has demonstrated progression since the radiation therapy
The patient has no major impairment of renal or hepatic function, as defined by the following laboratory parameters: total bilirubin <1.5 X ULN; AST, ALT<2.5X ULN (<5 X ULN if liver metastases are present)
Patients on Sandostatin Lar (long acting somatostatin analogue) must be on a stable dose for 30 days prior to study entry and short acting somatostatin analogues must be judged to be on a clinically stable dose by the investigator prior to study entry
Must have a life expectancy of greater than three (3) months
Karnofsky Performance Status > 60
Female patients must have a negative serum pregnancy test at screening. (Not applicable to patients with bilateral oophorectomy and/or hysterectomy or to those patients who are postmenopausal.)

Annotated entities:
- Condition: "metastatic carcinoid tumors"
- Value: "proven"
- Procedure: "biopsy"
- Condition: "other neuroendocrine tumors"
- Condition: "Islet cell"
- Condition: "Gastrinomas"
- Condition: "VIPomas"
- Condition: "measurable lesion"
- Qualifier: "bone"
- Procedure: "irradiated"
- Procedure: "irradiated"
- Observation: "progression"
- Procedure: "radiation therapy"
- Temporal: "since the radiation therapy"
- Negation: "not been"
- Reference_point: "radiation therapy"
- Negation: "other than"
- Condition: "major impairment of renal function"
- Condition: "major impairment of hepatic function"
- Negation: "no"
- Measurement: "total bilirubin"
- Value: "<1.5 X ULN"
- Measurement: "AST"
- Measurement: "ALT"
- Value: "<2.5X ULN"
- Condition: "liver metastases"
- Value: "<5 X ULN"
- Drug: "Sandostatin Lar"
- Drug: "long acting somatostatin analogue"
- Qualifier: "stable dose"
- Temporal: "for 30 days prior to study entry"
- Drug: "short acting somatostatin analogues"
- Qualifier: "clinically stable dose"
- Temporal: "prior to study entry"
- Observation: "life expectancy"
- Value: "greater than three (3) months"
- Measurement: "Karnofsky Performance Status"
- Value: "> 60"
- Person: "Female"
- Measurement: "serum pregnancy test"
- Value: "negative"
- Temporal: "at screening"
- Procedure: "bilateral oophorectomy"
- Procedure: "hysterectomy"
- Condition: "postmenopausal"